Clinical trial inclusion criterion:
Diagnosis of dyslipidemia: The existence of a previous clinical diagnostic of dyslipidemia associated with lipid-lowering therapy. It is also considered patients who have an altered analytical, using the following cutoffs: total cholesterol = 200 mg / dl, triglycerides = 180 mg / dl, HDL-cholesterol = 40 mg / dl or LDL-cholesterol = 150 mg / dl. Lipid-lowering treatment and diet, stable in the last month.

Entity relations:
- Has_value("total cholesterol", "= 200 mg / dl")
- Has_value("triglycerides", "= 180 mg / dl")
- Has_value("LDL-cholesterol", "= 150 mg / dl")
- Has_value("HDL-cholesterol", "= 40 mg / dl")
- Has_temporal("stable", "in the last month")
- Subsumes("altered analytical", "total cholesterol")
- Subsumes("dyslipidemia", "dyslipidemia")
- Subsumes("dyslipidemia", "lipid-lowering therapy")
- OR("total cholesterol", "HDL-cholesterol", "LDL-cholesterol", "triglycerides")
- OR("lipid-lowering therapy", "altered analytical")
- OR("dyslipidemia", "altered analytical")